4. HbA1c > 9%

The above is a clinical trial exclusion criterion. Annotated with entity spans:
[Parsing_Error: 4.] [Measurement: HbA1c] [Value: > 9%]